Clinical trial exclusion criterion:
estimated glomerular filtration rate (eGFR) < 45 ml/min/1.73m2

Annotated entities:
- Measurement: "estimated glomerular filtration rate (eGFR)"
- Value: "< 45 ml/min/1.73m2"